Estimated GFR <60 mL/min/1.73 m2 using the Cockcroft-Gault formula measurement of the individual parameters following at least 5 minutes of rest at Screening.

The above is a clinical trial exclusion criterion. Annotated with entity spans:
[Measurement: Estimated GFR] [Value: <60 mL/min/1.73 m2] using the [Observation: Cockcroft-Gault formula] measurement of the individual parameters following at least 5 minutes of rest at Screening.